Clinical trial exclusion criterion:
Preexisting medical condition (thyroid disease, diabetes mellitus, hypertension, pulmonary conditions, cardiac condition…).

Annotated entities:
- Condition: "thyroid disease"
- Condition: "diabetes mellitus"
- Condition: "hypertension"
- Condition: "pulmonary conditions"
- Condition: "cardiac condition"